Clinical trial inclusion criterion:
age 35-75 years;

Annotated entities:
- Person: "age"
- Value: "35-75 years"